Inability to provide written informed consent

The above is a clinical trial exclusion criterion. Annotated with entity spans:
[Post-eligibility: Inability to provide written informed consent]